normal OGTT

The above is a clinical trial inclusion criterion. Annotated with entity spans:
[Value: normal] [Measurement: OGTT]